Clinical trial exclusion criterion:
Genotype 2, 3, 5 or 6 infection.

Annotated entities:
- Measurement: "Genotype"
- Value: "2, 3, 5 or 6"
- Condition: "infection"